What percentage of C. elegans genes reside in operons?

about 15% of genes in Caenorhabditis elegans, a model organism belonging to Nematoda, reside in operons (Blumenthal et al. 2002; Blumenthal and Gleason 2003). For two reasons, nematode and prokaryotic operons are believed to have separate origins.